El grado de fluidez de las membranas biológicas depende del porcentaje de:
1. Lipidos con colina.
2. Glicolípidos.
3. Esfingolípidos.
4. Ácidos grasos libres.
5. Ácidos grasos insaturados.

Respuesta correcta: 5. Ácidos grasos insaturados.